下列有關股骨轉子間骨折的描述，何者錯誤？
A. 只要病人內科情況穩定時，即應進行手術內固定治療
B. 容易有不癒合及股骨頭缺血性壞死的併發症
C. 較常發生於年紀大者
D. 可能伴有遠端橈骨骨折及近端肱骨骨折

正確答案：B. 容易有不癒合及股骨頭缺血性壞死的併發症